Nonsmoking for 4 months prior to initial interview and throughout screening

The above is a clinical trial inclusion criterion. Annotated with entity spans:
[Condition: Nonsmoking] [Temporal: for 4 months prior to initial interview] and [Temporal: throughout screening]